Clinical trial exclusion criterion:
Drug/food allergy: Subjects with a history of hypersensitivity to any of the study medications (e.g. beta-agonists, corticosteroid) or components of the inhalation powder (e.g. lactose, magnesium stearate). In addition, patients with a history of severe milk protein allergy that, in the opinion of the study physician, contraindicates the subject's participation will also be excluded.

Entity relations:
- Subsumes("study medications", "beta-agonists")
- Subsumes("components of the inhalation powder", "lactose")
- AND("hypersensitivity", "study medications")
- Has_qualifier("milk protein allergy", "severe")
- Has_temporal("milk protein allergy", "history")
- OR("Drug allergy", "food allergy")
- OR("beta-agonists", "corticosteroid")
- OR("lactose", "magnesium stearate")
- OR("study medications", "components of the inhalation powder")